Clinical trial exclusion criterion:
NYHA III-IV heart function, or severe hepatic or renal insufficiency (Grade 4);

Entity relations:
- Has_value("NYHA", "III-IV")
- Subsumes("severe", "Grade 4")
- Has_qualifier("hepatic insufficiency", "severe")
- AND("heart function", "NYHA")
- Has_qualifier("renal insufficiency", "severe")
- OR("heart function", "hepatic insufficiency")